Clinical trial exclusion criterion:
Personal history of Guillain-Barré Syndrome.

Entity relations:
- Has_temporal("Guillain-Barré Syndrome", "history")